Clinical trial inclusion criterion:
Maternal or infant urine drug screen positive for methadone and/or opioids on admission

Entity relations:
- Has_qualifier("urine drug screen", "Maternal")
- Has_value("urine drug screen", "positive")
- Has_qualifier("urine drug screen", "methadone")
- OR("Maternal", "infant")
- OR("methadone", "opioids")